Clinical trial exclusion criterion:
Recent history of myocardial infarction, cerebrovascular accident, cardiac arrhythmias, or unstable heart disease.

Entity relations:
- Has_temporal("history", "Recent")
- Has_temporal("myocardial infarction", "history")
- OR("myocardial infarction", "cardiac arrhythmias", "cerebrovascular accident", "unstable heart disease")